Clinical trial exclusion criteria:
Congestive heart failure
Ischemic heart disease
Hypotension (Systolic blood pressure <100 mmHg)
Treatment with class I or III antiarrhythmic drugs
Severe hepatic or renal failure
Pregnancy or lactation
Hypersensitivity or contradictions to study drugs
Atrio-ventricular conduction disturbances
Thyrotoxicosis
Life limiting disease or substance abuse which may affect participation

Annotated entities:
- Condition: "Congestive heart failure"
- Condition: "Ischemic heart disease"
- Condition: "Hypotension"
- Measurement: "Systolic blood pressure"
- Value: "<100 mmHg"
- Qualifier: "class I"
- Qualifier: "class III"
- Drug: "antiarrhythmic drugs"
- Qualifier: "Severe"
- Condition: "renal failure"
- Condition: "hepatic failure"
- Condition: "Pregnancy"
- Condition: "lactation"
- Condition: "Hypersensitivity"
- Condition: "contradictions"
- Drug: "study drugs"
- Condition: "Atrio-ventricular conduction disturbances"
- Condition: "Thyrotoxicosis"
- Condition: "Life limiting disease"
- Condition: "substance abuse"
- Qualifier: "may affect participation"